為病患進行麻醉誘導時，下列何者會使麻醉氣體的最低肺泡濃度（minimum alveolar concentration;  MAC）增加？
A. 體溫 34℃
B. 急性酒精中毒（acute alcohol intoxication）
C. 長期酒精濫用（chronic alcohol abuse）
D. 動脈血中氧氣濃度（PaO2）低於 40 mmHg

正確答案：C. 長期酒精濫用（chronic alcohol abuse）